Clinical trial exclusion criterion:
15. Pregnant or nursing patients

Entity relations:
- OR("Pregnant", "nursing")